A qué hace referencia el término “Índice sérico”:
1. Determinación cuantitativa de hemoglobina, bilirrubina y lípidos presentes en una muestra de suero.
2. Un conjunto de pruebas que se pueden realizar en un analizador de bioquímica.
3. Un registro de calibraciones específicas de lote.
4. Un listado de valores de referencia referidos por edad, sexo y raza.
5. Un listado de conservantes que se pueden utilizar para mantener las muestras de suero durante más tiempo.

Respuesta correcta: 1. Determinación cuantitativa de hemoglobina, bilirrubina y lípidos presentes en una muestra de suero.